Which particular intersex phenotype is related to steroid reductase?

Steroid reductase mutations are associated with both sex-determining and non-syndromic hypospadias